下列何者不參與瞳孔對光的反射作用？
A. midbrain
B. ciliary ganglion
C. Edinger-Westphal nucleus
D. trigeminal nerve

正確答案：D. trigeminal nerve